Clinical trial inclusion criterion:
Patients with foot fracture scheduled for surgical repair in spinal anesthesia

Entity relations:
- AND("surgical repair", "spinal anesthesia")
- Has_mood("surgical repair", "scheduled for")